Patients who require at least 80% of their caloric intake as PN at study start, and in whom an indication for PN is expected for at least 5 days

The above is a clinical trial inclusion criterion. Annotated with entity spans:
Patients who require [Value: at least 80% of] their caloric intake as [Procedure: PN] [Temporal: at study start], and in whom an [Condition: indication] for [Procedure: PN] is [Mood: expected] [Multiplier: for at least 5 days]